有關腎上腺素（epinephrine）與乙型腎上腺素受體（β-adrenergic receptor）結合所產生的結果，下列敘述何者錯誤？
A. 刺激 Gs 蛋白次單元與 GTP 結合
B. 增加腺苷酸環化酶（adenylyl cyclase）活性
C. 增加蛋白激酶 A（protein kinase A）的酵素活性
D. 促進激素-受體複合物（hormone-receptor complex）的內噬（endocytosis）

正確答案：D. 促進激素-受體複合物（hormone-receptor complex）的內噬（endocytosis）